Clinical trial inclusion criterion:
Male or female on stable dose of IgPro20 (Hizentra) therapy.

Entity relations:
- Subsumes("IgPro20", "Hizentra")
- Has_qualifier("IgPro20", "stable dose")
- OR("Male", "female")